Provide written informed consent before initiation of any study procedures

The above is a clinical trial inclusion criterion. Annotated with entity spans:
[Informed_consent: Provide written informed consent before initiation of any study procedures]